Which is the protein-membrane interface of the Cholesterol-regulated Start protein 4 protein (STARD4)?

L124 is the protein-membrane interface of the Cholesterol-regulated Start protein 4 protein (STARD4).